Clinical trial exclusion criterion:
A positive drug screen for illicit drugs

Annotated entities:
- Procedure: "drug screen for illicit drugs"
- Value: "positive"